Clinical trial exclusion criterion:
Patients with severe renal impairment (CLcr = 29 mL/min, or eGFR = 29 mL/min/1.73 m2), or moderate or severe hepatic impairment (Child-Pugh classes B or C).

Annotated entities:
- Condition: "renal impairment"
- Qualifier: "severe"
- Measurement: "CLcr"
- Value: "= 29 mL/min"
- Measurement: "eGFR"
- Value: "= 29 mL/min/1.73 m2"
- Condition: "hepatic impairment"
- Qualifier: "severe"
- Qualifier: "moderate"
- Measurement: "Child-Pugh classes"
- Value: "B"
- Value: "C"